hypersensitivity to perindopril or to other ACE inhibitors, amlodipine, atorvastatin, dihydropyridines or to or statins

The above is a clinical trial exclusion criterion. Annotated with entity spans:
[Condition: hypersensitivity] to [Drug: perindopril] or to [Qualifier: other] [Drug: ACE inhibitors], [Drug: amlodipine], [Drug: atorvastatin], [Drug: dihydropyridines] or to or [Drug: statins]